Allergy to bupivacaine.

The above is a clinical trial exclusion criterion. Annotated with entity spans:
[Condition: Allergy] to [Drug: bupivacaine].